Which human disease is experimental autoimmune encephalomyelitis (EAE) model for?

Experimental autoimmune encephalomyelitis (EAE) is an animal model of MS (Multiple Sclerosis).